Clinical trial inclusion criterion:
Adequate Contraception

Entity relations:
- Has_qualifier("Contraception", "Adequate")